Previous treatment with any cell-depleting therapies

The above is a clinical trial inclusion criterion. Annotated with entity spans:
[Temporal: Previous] treatment with any [Procedure: cell-depleting therapies]